頸椎間管狹窄造成脊髓壓迫，導致頸脊髓病變（myelopathy），下述症狀何者較少出現？
A. 枕部神經痛（occipital neuralgia）
B. 痙攣（spasticity）
C. 深腱反射增加（increased deep tendon reflexes）
D. 病理反射 Babinski's sign, Hoffmann's sign：陽性

正確答案：A. 枕部神經痛（occipital neuralgia）